Clinical trial exclusion criteria:
If smoking and/or other drug addiction is present
If local anesthetic allergy is present
Patient subjected to chemical or radiotherapy
if Hepatic disease is present
If immunodepression is present
If Pregnancy is present
If Diabetes is present
If Heart disease is present

Annotated entities:
- Observation: "smoking"
- Condition: "drug addiction"
- Drug: "local anesthetic"
- Condition: "allergy"
- Procedure: "radiotherapy"
- Procedure: "chemical"
- Condition: "Hepatic disease"
- Condition: "immunodepression"
- Condition: "Pregnancy"
- Condition: "Diabetes"
- Condition: "Heart disease"